Con respecto a los puntos de control de la expresión de los genes eucariotas, indique cuál de las siguientes afirmaciones es falsa:
1. Modificación de la estructura del gen.
2. Regulación de la transcripción.
3. Maduración del RNA.
4. Maduración del DNA.
5. Estabilidad de los RNA.

Respuesta correcta: 4. Maduración del DNA.